Significant cognitive impairment, defined as a known diagnosis of dementia or a Mini-Mental State Examination exam score < 24

The above is a clinical trial exclusion criterion. Annotated with entity spans:
[Qualifier: Significant] [Condition: cognitive impairment], defined as a known diagnosis of [Condition: dementia] or a [Measurement: Mini-Mental State Examination] exam [Value: score < 24]